Clinical trial inclusion criterion:
Zubrod performance status of 0-3

Entity relations:
- Has_value("Zubrod performance status", "0-3")